What is a circRNA?

Circular RNAs (circRNAs) are a new class of non-coding RNA with a stable structure formed by special loop splicing.